下列何種情況，最不可能會有寬的脈搏壓（wide pulse pressure）？
A. 甲狀腺機能亢進
B. 貧血
C. 主動脈瓣逆流
D. 二尖瓣狹窄

正確答案：D. 二尖瓣狹窄